stable HbA1c (± 0.5%) for at least 12 weeks

The above is a clinical trial inclusion criterion. Annotated with entity spans:
stable [Measurement: HbA1c] ([Value: ± 0.5%]) for [Temporal: at least 12 weeks]